Clinical trial exclusion criterion:
Patients with a history of hypothyroidism unless taking a stable dose of thyroid medication and asymptomatic or euthyroid for 6 months;

Annotated entities:
- Condition: "hypothyroidism"
- Negation: "unless"
- Drug: "thyroid medication"